下列那一項目為全民健保「財務責任制度」未能落實的最重要因素？
A. 政府未補貼健保之虧損
B. 未依精算結果調整費率
C. 未落實轉診制度
D. 無財務精算報告

正確答案：B. 未依精算結果調整費率